4. Life expectancy > 3 months

The above is a clinical trial inclusion criterion. Annotated with entity spans:
[Parsing_Error: 4.] [Observation: Life expectancy] [Value: > 3 months]